Clinical trial exclusion criterion:
Major neurologic developmental delay

Annotated entities:
- Condition: "Major neurologic developmental delay"